Clinical trial exclusion criterion:
Substance abuse

Annotated entities:
- Condition: "Substance abuse"